Clinical trial exclusion criterion:
The participant has received levodopa monotherapy, any psychoneurotic agent or antiemetic medication of dopamine agonist within 14 days. However, the participant has been receiving quetiapine or domperidone with a stable dose regimen for >= 14 days may be included in the study.

Entity relations:
- AND("levodopa monotherapy", "levodopa")
- Has_temporal("levodopa monotherapy", "within 14 days")
- Has_temporal("stable dose", ">= 14 days")
- Has_qualifier("quetiapine", "stable dose")
- OR("levodopa", "psychoneurotic agent", "antiemetic medication of dopamine agonist")
- OR("quetiapine", "domperidone")